En el tratamiento psicológico de las pesadillas recurrentes en la infancia:
1. Se entrena a los padres para extinguir, ignorándolas, las manifestaciones de ansiedad del niño que ha sufrido una pesadilla.
2. El objetivo principal es asegurar la seguridad física del niño.
3. Las técnicas de exposición y la desensibilización sistemática se consideran tratamientos bien establecidos.
4. La técnica de repaso en imaginación es la que ha recibido el mayor apoyo empírico.
5. No existen estudios acerca de la eficacia terapéutica de la hipnosis.

Respuesta correcta: 4. La técnica de repaso en imaginación es la que ha recibido el mayor apoyo empírico.